Not diagnosed with Type 2 diabetes.

The above is a clinical trial inclusion criterion. Annotated with entity spans:
[Negation: Not] diagnosed with [Condition: Type 2 diabetes].